Clinical trial inclusion criterion:
Be at least 18 years of age and able to give informed consent.

Entity relations:
- Has_value("age", "at least 18 years")